Toxic epidermal necrolysis with SCORTEN 6 or 7 at admission

The above is a clinical trial exclusion criterion. Annotated with entity spans:
[Condition: Toxic epidermal necrolysis] with [Measurement: SCORTEN] [Value: 6 or 7] [Temporal: at admission]